El óxido nítrico (NO) se genera de forma endógena a partir de:
1. Arginina.
2. Lisina.
3. Asparagina.
4. Glutamina.

Respuesta correcta: 1. Arginina.